Clinical trial exclusion criterion:
Other intervention for reduction of IAP planned

Annotated entities:
- Qualifier: "Other"
- Procedure: "intervention for reduction of IAP"
- Mood: "planned"